Planned total or near-total thyroidectomy

The above is a clinical trial inclusion criterion. Annotated with entity spans:
Planned [Qualifier: total] or [Qualifier: near-total] [Procedure: thyroidectomy]